Known coronary artery disease or type I DM with microvascular complications or signs of heart failure or clinical dissection of the aorta

The above is a clinical trial exclusion criterion. Annotated with entity spans:
Known [Condition: coronary artery disease] or [Condition: type I DM] with [Condition: microvascular complications] or signs of [Condition: heart failure] or clinical [Condition: dissection of the aorta]